Un recién nacido prematuro presenta a los 2 días de vida un cuadro de mal estado general, petequias y equimosis subcutáneas y sangrado persistente por las zonas de punción. La radiografía de tórax es compatible con una hemorragia pulmonar. En el estudio de coagulación los tiempos de protrombina y parcial de tromboplastina están alargados. El recuento de plaquetas es de 105.000/uL. ¿Cuál es el diagnóstico más probable?
1. Coagulación       intravascular   diseminada secundaria a una sepsis neonatal.
2. Trombocitopenia neonatal autoinmunitaria.
3. Trombocitopenia neonatal aloinmunitaria.
4. Enfermedad hemorrágica del recién nacido por déficit de vitamina K.
5. Hemorragia       neonatal    por   disfunción plaquetaria.

Respuesta correcta: 1. Coagulación       intravascular   diseminada secundaria a una sepsis neonatal.